Clinical trial exclusion criterion:
6. Have a history of serious adverse gastrointestinal events (i.e., bleeding or perforation),history of a coagulopathy or current anti-coagulant use.

Entity relations:
- Has_qualifier("adverse gastrointestinal events", "serious")
- Subsumes("adverse gastrointestinal events", "bleeding")
- Has_temporal("adverse gastrointestinal events", "history")
- Has_temporal("coagulopathy", "history")
- Has_temporal("anti-coagulant", "current")
- OR("bleeding", "perforation")
- OR("adverse gastrointestinal events", "anti-coagulant", "coagulopathy")